Clinical trial exclusion criterion:
1. Justification: the population of interest here is a healthy control population with no present or past substance use disorder.

Annotated entities:
- Parsing_Error: "1."
- Parsing_Error: "Justification: the population of interest here is a healthy control population with no present or past substance use disorder."
- Not_a_criteria: "Justification: the population of interest here is a healthy control population with no present or past substance use disorder."